下列何者不是慢性腎衰竭病童可能於初次門診確定診斷前，常見之主訴症候？
A. 矮小、長不高（short stature）
B. 貧血（anemia）、臉色蒼白（pallor）
C. 維生素 K 缺乏相關出血傾向（bleeding tendency）
D. 蛋白尿、血尿或水腫

正確答案：C. 維生素 K 缺乏相關出血傾向（bleeding tendency）